Clinical trial inclusion criterion:
RA cohort: Receiving MTX at stable doses of 10 to 25 mg weekly for at least 12 weeks, Have a DAS28 of 3.2 or higher (The level of disease activity is considered to be low if the DAS28 is 3.2 or less) (Prevoo et al., 1995)

Annotated entities:
- Condition: "RA"
- Drug: "MTX"
- Multiplier: "stable doses"
- Multiplier: "10 to 25 mg weekly"
- Temporal: "for at least 12 weeks"
- Measurement: "DAS28"
- Value: "3.2 or higher"
- Non-representable: "(The level of disease activity is considered to be low if the DAS28 is 3.2 or less) (Prevoo et al., 1995)"